Inhibe la secreción de gastrina la:
1. Estimulación parasimpática.
2. Vista, aroma y gusto del alimento.
3. Distensión del estómago.
4. Presencia de proteínas en el estómago.
5. Somatostatina.

Respuesta correcta: 5. Somatostatina.